有關急性肌腔室症候群（acute compartment syndrome）之敘述，下列何者錯誤？
A. 組織缺血（ischemia）常導致疼痛
B. 施與被動式伸展時會疼痛（pain on passive stretch）與休息時會疼痛（rest pain）對診斷之敏感性
C. 神經缺血（ischemia）常導致感覺異常（paresthesia）及感覺遲鈍（hypoesthesia）
D. 如果發現周邊脈搏（peripheral pulse）還存在，幾乎可以排除其可能性

正確答案：D. 如果發現周邊脈搏（peripheral pulse）還存在，幾乎可以排除其可能性